Clinical trial inclusion criterion:
Non-invasive tear film break-up time (NITBUT) <10 s in at least one eye

Annotated entities:
- Measurement: "Non-invasive tear film break-up time (NITBUT)"
- Value: "<10 s"
- Multiplier: "at least one"
- Qualifier: "eye"